Cardiac disease (congenital or acquired)

The above is a clinical trial exclusion criterion. Annotated with entity spans:
[Condition: Cardiac disease] ([Qualifier: congenital] or [Qualifier: acquired])